Clinical trial exclusion criterion:
Inability to understand and comply with the instructions of the study

Annotated entities:
- Non-query-able: "Inability to understand and comply with the instructions of the study"